Subject has a bone stock compromised by disease, infection or prior implantation which cannot provide adequate support and/or fixation to the devices.

The above is a clinical trial inclusion criterion. Annotated with entity spans:
Subject has a [Condition: bone stock compromised] by [Condition: disease], [Condition: infection] or [Temporal: prior] [Procedure: implantation] which [Measurement: cannot] provide [Observation: adequate support] and/or [Procedure: fixation to the devices].